Clinical trial exclusion criterion:
Has a history of known demyelinating diseases such as multiple sclerosis or optic neuritis

Annotated entities:
- Condition: "demyelinating diseases"
- Temporal: "history"
- Condition: "multiple sclerosis"
- Condition: "optic neuritis"